Renal failure, moderate or severe renal impairment (estimated glomerular filtration rate < 30 mL/min/1.73 m2), or ongoing dialysis

The above is a clinical trial exclusion criterion. Annotated with entity spans:
[Condition: Renal failure], [Qualifier: moderate] or [Qualifier: severe] [Condition: renal impairment] ([Measurement: estimated glomerular filtration rate] [Value: < 30 mL/min/1.73 m2]), or [Temporal: ongoing] [Procedure: dialysis]